關於缺鐵性貧血（Iron-deficiency anemia）病人，如果沒有發生心衰竭或嚴重胃腸道出血，下列何者錯誤？
A. 服用鐵劑後注意腸胃及便秘情形
B. 網狀紅血球追蹤檢查
C. 在血液常規檢查正常後，一般建議繼續給與鐵劑治療2-3個月
D. 立即給與紅血球輸血

正確答案：D. 立即給與紅血球輸血